systolic blood pressure between 140-160 mmHG

The above is a clinical trial inclusion criterion. Annotated with entity spans:
[Measurement: systolic blood pressure] [Value: between 140-160 mmHG]